Clinical trial exclusion criterion:
9. Patients taking melatonin receptor agonists (such as Rozerem® [ramelteon]).

Entity relations:
- Subsumes("Rozerem", "ramelteon")
- Subsumes("melatonin receptor agonists", "Rozerem")